Clinical trial exclusion criterion:
4. significant coagulopathy( prothrombin time >15 seconds, INR>1.5

Entity relations:
- Has_value("prothrombin time", ">15 seconds")
- Has_value("INR", ">1.5")
- Subsumes("significant", "prothrombin time")
- Has_qualifier("coagulopathy", "significant")
- Subsumes("significant", "INR")